Cyanotic heart disease (congenital or acquired)

The above is a clinical trial exclusion criterion. Annotated with entity spans:
[Condition: Cyanotic heart disease] ([Qualifier: congenital] or [Qualifier: acquired])